Clinical trial inclusion criterion:
Adult (>18 years of age and older) patients who have or will have undergone surgical resection or biopsy of a supratentorial brain tumor and are able to consent for themselves.

Annotated entities:
- Person: "Adult"
- Value: "and older >18 years"
- Person: "age"
- Mood: "will have undergone"
- Procedure: "surgical resection"
- Procedure: "biopsy"
- Condition: "supratentorial brain tumor"
- Informed_consent: "are able to consent for themselves"